administration of anti-thymocyte globulin,

The above is a clinical trial exclusion criterion. Annotated with entity spans:
administration of [Drug: anti-thymocyte globulin],